關於應力性骨折（stress fracture），下列敘述何者錯誤？
A. 脛骨應力性骨折（tibial stress fracture）是下肢最常見的應力性骨折
B. 蹠骨應力性骨折（metatarsal stress fracture）最常發生在第一蹠骨（first metatarsal）
C. 大部分的肱骨應力性骨折（humeral stress fracture）發生在棒球投手中
D. 治療的基本原則是給予適當的休息，避免反覆性的負重，使骨骼有足夠的時間新生及修復

正確答案：B. 蹠骨應力性骨折（metatarsal stress fracture）最常發生在第一蹠骨（first metatarsal）